Clinical trial exclusion criterion:
regular herbal medicine or antioxidant supplementation.

Entity relations:
- OR("herbal medicine", "antioxidant supplementation")